Individuals of both sexes from 18 years with a diagnosis of community-acquired pneumonia, COPD or Bronchial Asthma;

The above is a clinical trial inclusion criterion. Annotated with entity spans:
Individuals of [Person: both sexes] [Value: from 18 years] with a diagnosis of [Condition: community-acquired pneumonia], [Condition: COPD] or [Condition: Bronchial Asthma];